知情同意書的設立，在於避免那一醫學倫理原則被侵犯？
A. 行善原則
B. 不傷害原則
C. 正義原則
D. 尊重自主原則

正確答案：D. 尊重自主原則